En respuesta a un aumento en la concentración de adrenalina y glucagón circulante:
1. Se activa la fosforilación de la glucógenofosforilasa y la degradación del glucógeno.
2. Aumenta la concentración intracelular de cAMP, y por ello, la síntesis del glucógeno.
3. Disminuye la concentración intracelular de cAMP y la degradación del glucógeno.
4. Se activa la fosforilación de la glucógenosintasa y la síntesis del glucógeno.
5. Aumenta la concentración intracelular de ATP y la glucogenogénesis.

Respuesta correcta: 1. Se activa la fosforilación de la glucógenofosforilasa y la degradación del glucógeno.